What is the purpose of  Macropinocytosis?

Macropinocytosis is an endocytic process, which involves the engulfment of extra-cellular content in vesicles known as macropinosomes.